Which part of the TNFR2 gene is genetically associated with Systemic Lupus Erythematosus?

A TNFR2 3' flanking region polymorphism in systemic lupus erythematosus.